Clinical trial exclusion criterion:
Congenital or acquired immunodeficiency or ongoing therapy that cause immunosuppression

Entity relations:
- AND("that cause immunosuppression", "immunosuppression")
- Has_qualifier("therapy that cause immunosuppression", "that cause immunosuppression")
- Has_temporal("therapy that cause immunosuppression", "ongoing")
- OR("acquired immunodeficiency", "therapy that cause immunosuppression", "immunodeficiency Congenital")